關於早期非小細胞肺癌（non-small cell lung cancer）處置的敘述，下列何者錯誤？
A. 在 IA 期，肺葉切除術（lobectomy）比楔狀切除術（wedge resection）有比較低的局部復發率
B. 若有共病（comorbidities），肺功能差的患者，可以考慮楔狀切除（wedge resection）或肺節切除
C. 第一期非小細胞肺癌病人的五年存活率約 60-80 %
D. 第 IA 期病人術後輔助化學治療（adjuvant chemotherapy）有存活上的好處

正確答案：D. 第 IA 期病人術後輔助化學治療（adjuvant chemotherapy）有存活上的好處